Clinical trial inclusion criterion:
Only children well enough to be discharged to home at the conclusion of the PED visit are eligible.

Entity relations:
- multi("the conclusion of the PED visit", "PED")
- Has_index("at the conclusion of the PED visit", "the conclusion of the PED visit")
- Has_temporal("well enough to be discharged to home", "at the conclusion of the PED visit")